一位 8 歲的女孩，主訴下腹痛被帶到門診，超音波檢查發現右側卵巢有一顆 6 公分的腫瘤，下列的診斷何者最有可能？
A. 良性上皮性腫瘤（benign epithelial neoplasm）
B. 惡性上皮性腫瘤（malignant epithelial neoplasm）
C. 濾泡性囊腫（follicular cyst）
D. 生殖細胞腫瘤（germ cell tumor）

正確答案：D. 生殖細胞腫瘤（germ cell tumor）